A biologic medicine used within the previous 6 months

The above is a clinical trial exclusion criterion. Annotated with entity spans:
A [Drug: biologic medicine] used [Temporal: within the previous 6 months]